Clinical trial exclusion criterion:
Uncontrolled thyroid disorders.

Entity relations:
- Has_qualifier("thyroid disorders", "Uncontrolled")